2. Osteoporosis with high risk of pathological fracture

The above is a clinical trial exclusion criterion. Annotated with entity spans:
[Parsing_Error: 2.] [Condition: Osteoporosis] with [Qualifier: high risk of pathological fracture]